Which organs are mostly affected in Systemic Lupus Erythematosus (SLE)?

In systemic lupus erythematosus (SLE), brain and kidney are the most frequently affected organs.